The existence of RPE tear

The above is a clinical trial exclusion criterion. Annotated with entity spans:
The existence of [Condition: RPE tear]